Subjects who have systemic infection

The above is a clinical trial exclusion criterion. Annotated with entity spans:
Subjects who have [Condition: systemic infection]